Clinical trial exclusion criterion:
Any evidence of clinical autoimmunity.

Annotated entities:
- Condition: "autoimmunity"
- Condition: "Any evidence of clinical autoimmunity"